Patients who received immunosuppressive medication in the last 6 weeks (e.g. cyclosporin, cyclophosphamide, azathioprine).

The above is a clinical trial exclusion criterion. Annotated with entity spans:
Patients who received [Procedure: immunosuppressive medication] [Temporal: in the last 6 weeks] (e.g. [Drug: cyclosporin], [Drug: cyclophosphamide], [Drug: azathioprine]).